Una diferencia entre el genero Vibrio y las enterobacterias es ser:
1. Anaerobio estricto.
2. Halófilo.
3. Oxidasa negativo de flagelación peritrica.
4. Muy exigente nutricionalmente.
5. No fermentar la glucosa.

Respuesta correcta: 2. Halófilo.